Clinical trial exclusion criterion:
Chronic preoperative opioid consumption.

Annotated entities:
- Qualifier: "Chronic"
- Temporal: "preoperative"
- Drug: "opioid"